In which cells does TLR7 escape X-chromosome inactivation?

TLR7 evades silencing by X chromosome inactivation in immune cells.